El cociente intelectual es un número que describe cuantitativamente la inteligencia de las personas. Se calcula:
1. A partir del rendimiento académico y/o el éxito profesional.
2. Dividiendo la edad mental por la edad cronológica y multiplicando por 100 el resultado.
3. Multiplicando la edad cronológica por 100 y dividiendo el resultado por la edad mental.
4. Dividiendo la edad cronológica por la edad mental y multiplicando el resultado por 100.

Respuesta correcta: 2. Dividiendo la edad mental por la edad cronológica y multiplicando por 100 el resultado.